Clinical trial exclusion criterion:
History of clinically significant disease, including any cardiovascular, hepatic, renal, respiratory, hematologic, endocrinologic, or neurologic disease, or clinically significant laboratory abnormality that is not stabilized or is anticipated to require treatment during the study.

Entity relations:
- Has_qualifier("disease", "clinically significant")
- Has_negation("stabilized", "not")
- Has_temporal("treatment", "during the study")
- Has_mood("treatment", "anticipated to require")
- Has_qualifier("laboratory abnormality", "clinically significant")
- Has_qualifier("laboratory abnormality", "stabilized")
- OR("disease", "respiratory disease", "renal disease", "cardiovascular disease", "endocrinologic disease", "hepatic disease", "laboratory abnormality", "hematologic disease")
- OR("stabilized", "treatment")